La enfermedad de Crohn es un proceso inflamatorio que se caracteriza porque:
1. Afecta a la mucosa superficial del colon.
2. Cursa generalmente con hemorragia rectal.
3. La afectación es uniforme, produciendo lesiones continuas.
4. La colectomía cura la enfermedad.
5. Afecta a cualquier tramo del tubo gastrointestinal.

Respuesta correcta: 5. Afecta a cualquier tramo del tubo gastrointestinal.